no previous protease inhibitor resistance documented on HIV-1 genotypic resistance testing

The above is a clinical trial inclusion criterion. Annotated with entity spans:
no previous [Condition: protease inhibitor resistance] documented on [Procedure: HIV-1 genotypic resistance testing]